Clinical trial exclusion criterion:
Presence or history of autoimmune disease as judged by the investigator

Annotated entities:
- Condition: "autoimmune disease"
- Parsing_Error: "Presence or history"
- Subjective_judgement: "as judged by the investigator"